Which diseases are caused by mutations in Calsequestrin 2 (CASQ2) gene?

CASQ2 mutations are associated with autosomal recessive catecholaminergic polymorphic ventricular tachycardia (CPVT) and familial hypertrophic cardiomyopathy.